下列有關膀胱（urinary bladder）的敘述，何者錯誤？
A. 內襯上皮的胚胎起源是內胚層（endoderm）
B. 膀胱三角（trigone）起源於後腎管（metanephric duct）
C. 六歲時進入大骨盆（greater pelvis）
D. 在胚胎時期與尿囊（allantois）相連

正確答案：B. 膀胱三角（trigone）起源於後腎管（metanephric duct）